Describe the INSPEcT R package

InSPEcT is an R package for the integrative analysis of RNA-seq data to study the dynamics of transcriptional regulation.